Clinical trial inclusion criterion:
Experience with frequent (2-7 times per week) infusions of IgPro20 at the tolerated flow rate of approximately 0.5 mL/min (equivalent of 25-30 mL/h) per injection site for at least 1 month prior to Day 1. The dose (volume) per injection site should not exceed 25 mL.

Entity relations:
- Has_qualifier("IgPro20", "frequent")
- Has_multiplier("IgPro20", "2-7 times per week")
- Has_multiplier("IgPro20", "per injection site flow rate of approximately 0.5 mL/min")
- Subsumes("per injection site flow rate of approximately 0.5 mL/min", "25-30 mL/h")
- Has_temporal("IgPro20", "for at least 1 month prior to Day 1")
- Has_index("for at least 1 month prior to Day 1", "Day 1")
- Has_negation("exceed 25 mL.", "not")
- Has_multiplier("IgPro20", "exceed 25 mL.")